Clinical trial inclusion criterion:
Non-smoking, or smoking no more than 10 cigarettes, or 2 cigars, or 2 pipes per day for at least 3 months prior to selection

Entity relations:
- Has_negation("smoking", "Non")
- Has_multiplier("cigarettes", "no more than 10 per day")
- Has_multiplier("cigars", "no more than 2 per day")
- Has_multiplier("pipes", "no more than 2 per day")
- Has_context("smoking", "cigarettes")
- multi("for at least 3 months prior to selection", "selection")
- Has_temporal("smoking", "for at least 3 months prior to selection")
- OR("smoking", "smoking")
- OR("cigarettes", "cigars", "pipes")